Clinical trial exclusion criterion:
Bismuth compounds, acid inhibitor, or antibiotics during 4 weeks before the patient is enrolled

Annotated entities:
- Drug: "Bismuth compounds"
- Drug: "acid inhibitor"
- Drug: "antibiotics"
- Temporal: "during 4 weeks before the patient is enrolled"
- Reference_point: "the patient is enrolled"